Clinical trial inclusion criterion:
Must have failed after fluoropyrimidine-, oxaliplatin-, and irinotecan-containing chemotherapy regimens for metastatic disease. Failure is defined as either disease progression (clinical or radiological) or intolerance to the regimen. Metastatic relapse within 6 months after completing adjuvant chemotherapy (with either an irinotecan or oxaliplatin containing regimen) will also be considered as treatment failure of a prior regimen for metastatic disease. Laboratory: Adequate baseline organ function defined by (<=7 days prior to first dose of study treatment).

Annotated entities:
- Qualifier: "failed"
- Procedure: "fluoropyrimidine- containing chemotherapy"
- Procedure: "oxaliplatin- containing chemotherapy"
- Procedure: "irinotecan-containing chemotherapy"
- Condition: "metastatic disease"
- Condition: "disease progression"
- Condition: "intolerance"
- Procedure: "the regimen"
- Condition: "Metastatic relapse"
- Temporal: "within 6 months after completing adjuvant chemotherapy"
- Reference_point: "after completing adjuvant chemotherapy"
- Procedure: "irinotecan containing regimen"
- Procedure: "oxaliplatin containing regimen"
- Condition: "Adequate baseline organ function"
- Temporal: "<=7 days prior to first dose of study treatment"
- Reference_point: "first dose of study treatment"